以下情況是涉及藥商與醫師的關係，何者在倫理上可以被接受？
A. 某醫院的主任級醫師舉家出國旅行，藥商負責接送至機場及返家
B. 某醫學中心腸胃科醫師有胃酸逆流的症狀，由藥商長期免費提供抑制胃酸分泌的藥物
C. 某醫院某專科之晨會，長期由某藥商提供早餐
D. 某藥商有一項新藥研發會議在國外舉行，藥商提供經費由醫院指派醫師參加

正確答案：D. 某藥商有一項新藥研發會議在國外舉行，藥商提供經費由醫院指派醫師參加